Clinical trial inclusion criterion:
20 - 65 years old

Annotated entities:
- Person: "old"
- Value: "20 - 65 years"